Clinical trial inclusion criterion:
=1 appropriate ICD shocks,

Entity relations:
- Has_multiplier("ICD shocks", "=1")